Herpes viruses have what type of genome?

The Herpesviridae are a family of viruses which have a large genome of linear, double-stranded DNA (> 120 kb)